Clinical trial exclusion criterion:
adjuvant radiotherapy

Annotated entities:
- Procedure: "adjuvant radiotherapy"